Clinical trial inclusion criterion:
Male or female >= 18 years of age

Annotated entities:
- Person: "Male"
- Person: "female"
- Value: ">= 18 years"
- Person: "age"